Clinical trial exclusion criterion:
Current treatment with corticosteroids (topical or systemic), corticosteroid use within 3 months before possible start of trial treatment, or anticipated start of corticosteroid treatment within the first 2 years from the start of the trial period;

Annotated entities:
- Drug: "corticosteroids"
- Temporal: "Current"
- Qualifier: "topical"
- Qualifier: "systemic"
- Procedure: "corticosteroid use"
- Temporal: "within 3 months before possible start of trial treatment"
- Reference_point: "possible start of trial treatment"
- Procedure: "corticosteroid treatment"
- Temporal: "within the first 2 years from the start of the trial period"
- Reference_point: "the first 2 years from the start of the trial period"
- Mood: "anticipated"